內分泌腺（endocrine gland）中，主要由濾泡（follicle）所組成的是：
A. 胰臟（pancreas）
B. 腎上腺（adrenal gland）
C. 甲狀腺（thyroid gland）
D. 松果腺（pineal gland）

正確答案：C. 甲狀腺（thyroid gland）